下咽癌患者接受直接喉鏡檢查時發現腫瘤侵犯左側梨形窩（pyriform sinus）及環狀軟骨後區 （postcricoid region），並往下延伸至頸部食道，磁核共振掃描呈現甲狀軟骨與環狀軟骨被腫瘤侵犯，但其他檢查並無發現遠端轉移情形，心肺功能無特殊異常；針對此病例，目前最常採用的治療方式為何？
A. 以器官保留方式給予放射治療後，再給予輔助性化學治療
B. 以器官保留方式給予同步化學治療與放射治療
C. 咽喉切除手術後，再給予輔助性標靶治療
D. 咽喉切除手術後，再給予輔助性化學治療與放射治療

正確答案：D. 咽喉切除手術後，再給予輔助性化學治療與放射治療